Which is the most mutated gene in dilated cardiomyopathy (DCM)?

lamin a/c gene (lmna)